Clinical trial exclusion criterion:
8. Creatine kinase above ULN

Annotated entities:
- Parsing_Error: "8."
- Measurement: "Creatine kinase"
- Value: "above ULN"